receive standard neo-adjuvant chemotherapy, adjuvant chemotherapy,and standard surgical treatment

The above is a clinical trial inclusion criterion. Annotated with entity spans:
receive [Procedure: standard neo-adjuvant chemotherapy], [Procedure: adjuvant chemotherapy],and [Procedure: standard surgical treatment]